Clinical trial exclusion criterion:
History of diabetic ketoacidosis, pancreas or beta-cell transplantation, or diabetes secondary to pancreatitis or pancreatectomy; acute or chronic infective diseases, cancer or chemotherapy, history of pulmonary, renal or liver diseases, and drug abuse

Annotated entities:
- Condition: "diabetic ketoacidosis"
- Procedure: "pancreas transplantation"
- Procedure: "beta-cell transplantation"
- Condition: "diabetes"
- Procedure: "pancreatitis"
- Procedure: "pancreatectomy"
- Qualifier: "secondary to"
- Qualifier: "acute"
- Qualifier: "chronic"
- Condition: "infective diseases"
- Condition: "cancer"
- Procedure: "chemotherapy"
- Condition: "liver diseases"
- Condition: "renal diseases"
- Condition: "pulmonary diseases"
- Condition: "drug abuse"
- Temporal: "History"